Clinical trial exclusion criterion:
high blood pressure (>160/100mmHg)

Annotated entities:
- Condition: "high blood pressure"
- Value: ">160/100mmHg"
- Measurement: "blood pressure"